馬拉松選手剛跑完全程後突然暈倒，其原因以下列何者最常見？
A. 心律不整
B. 血壓降低
C. 血液中鈉離子濃度太低
D. 血糖太低

正確答案：B. 血壓降低